ASA(American Society of Anesthesiologists) physical status class I or II

The above is a clinical trial inclusion criterion. Annotated with entity spans:
[Measurement: ASA]([Measurement: American Society of Anesthesiologists]) physical status class [Value: I or II]